What is the basis of the methidiumpropyl-EDTA sequencing (MPE-seq) method?

digestion of nuclei withmpe-fe(ii)